與消化道類癌（carcinoid tumor）引起之類癌症候群（carcinoid syndrome），無關之症狀為下列何者？
A. 顏面潮紅
B. 糙皮病（pellagra）
C. 氣喘樣症狀
D. 便秘

正確答案：D. 便秘